下列何者為不參與細胞毒殺作用的分子？
A. 穿孔素（perforin）和顆粒相關酵素（granule-associated enzymes；granzymes）
B. FasL 和 Fas 的作用
C. 氧反應代謝物（reactive oxygen intermediates）和一氧化氮（NO）
D. 整合凝集素（integrin）和纖維網蛋白（fibronectin）的作用

正確答案：D. 整合凝集素（integrin）和纖維網蛋白（fibronectin）的作用